Clinical trial exclusion criterion:
Prisoners

Annotated entities:
- Person: "Prisoners"